With severe cardio-pulmonary dysfunction, such as left heart failure, unstable arrhythmia, etc.

The above is a clinical trial exclusion criterion. Annotated with entity spans:
With [Qualifier: severe] [Condition: cardio-pulmonary dysfunction], such as [Condition: left heart failure], [Qualifier: unstable] [Condition: arrhythmia], etc.